STEMI due to bypass-graft occlusion

The above is a clinical trial exclusion criterion. Annotated with entity spans:
[Condition: STEMI] due to [Device: bypass-graft] [Condition: occlusion]